Children and caregivers who are unable to complete assessments for any reason;

The above is a clinical trial exclusion criterion. Annotated with entity spans:
[Informed_consent: Children and caregivers who are unable to complete assessments for any reason];